Un paciente con dispepsia va a someterse a una prueba de detección de Helicobacter pylori. Antes de la realización de la prueba, el paciente debe saber que:
1. El tratamiento con inhibidores de la bomba de protones debe suspenderse al menos una semana antes de la prueba.
2. El tratamiento con inhibidores de la bomba de protones debe suspenderse al menos dos semanas antes de la prueba.
3. El uso de los antiácidos también modifica los resultados de la prueba.
4. El uso de los antibióticos no modifica las pruebas diagnosticas para H. pylori.
5. Los tratamientos antibióticos negativizan las pruebas diagnósticas para H. pylori, por lo que deben evitarse dichos fármacos durante una semana antes de cualquier test diagnóstico.

Respuesta correcta: 2. El tratamiento con inhibidores de la bomba de protones debe suspenderse al menos dos semanas antes de la prueba.